Clinical trial exclusion criterion:
Significant anemia or polycythemia defined as hemoglobin >18gm/dL or hemoglobin <7gm/dL

Annotated entities:
- Qualifier: "Significant"
- Condition: "anemia"
- Condition: "polycythemia"
- Measurement: "hemoglobin"
- Value: ">18gm/dL"
- Measurement: "hemoglobin"
- Value: "<7gm/dL"